Clinical trial inclusion criteria:
1. Cognitive impairment from mild to moderate degree defined by a Clinical Deterioration Rating (CDR) score range between 0.5 and 2.0.
2. Evidence on brain MRI of white matter hyperintensities (leukoaraiosis of moderate or severe degree according to the modified Fazekas visual scale and/or presence of lacunar infarcts).
3. Consent to participation in the study.

Annotated entities:
- Condition: "Cognitive impairment"
- Qualifier: "mild to moderate"
- Measurement: "Clinical Deterioration Rating (CDR) score"
- Value: "range between 0.5 and 2.0"
- Parsing_Error: "1."
- Procedure: "brain MRI"
- Observation: "white matter hyperintensities"
- Condition: "leukoaraiosis"
- Value: "moderate or severe degree"
- Measurement: "modified Fazekas visual scale"
- Condition: "lacunar infarcts"
- Parsing_Error: "2."
- Parsing_Error: "3."
- Non-query-able: "Consent to participation in the study."